Patients incapable to understanding and will;

The above is a clinical trial exclusion criterion. Annotated with entity spans:
Patients [Observation: incapable to understanding] and [Observation: will];